對於無法手術的轉移性胰臟內分泌瘤病患，可使用的治療中，何者正確？
A. hypergastrinemia可以diazoxide治療
B. 對於gastrinoma引起的腸胃道急性出血，使用proton pump inhibitors是無效的
C. 儘可能以手術切除metastatic islet cell carcinoma（cytoreduction surgery）後，肝臟轉移的部分可以肝動脈栓塞來治療
D. 轉移到骨骼的metastatic islet cell carcinoma還是可以考慮以手術切除之

正確答案：C. 儘可能以手術切除metastatic islet cell carcinoma（cytoreduction surgery）後，肝臟轉移的部分可以肝動脈栓塞來治療